Clinical trial exclusion criterion:
Concomitant surgical procedure other than CABG

Entity relations:
- Has_temporal("surgical procedure", "Concomitant")
- Has_qualifier("CABG", "other than")
- AND("surgical procedure", "CABG")